Clinical trial inclusion criterion:
Adequate performance status:

Entity relations:
- Has_value("performance status", "Adequate")